Anticipated ventilation of =72 hours at the time of screening, as per the ICU physician.

The above is a clinical trial inclusion criterion. Annotated with entity spans:
[Mood: Anticipated] [Procedure: ventilation] of [Temporal: =72 hours] at the time of screening, as per the ICU physician.